Diabetes mellitus

The above is a clinical trial inclusion criterion. Annotated with entity spans:
[Condition: Diabetes mellitus]